Clinical trial inclusion criteria:
CPPE along with evidence of septated pleural effusion on pleural ultrasonography and/or chest CT scan
empyema.

Annotated entities:
- Condition: "septated pleural effusion"
- Procedure: "pleural ultrasonography"
- Procedure: "chest CT scan"
- Condition: "CPPE"
- Mood: "evidence of"
- Condition: "empyema"